Clinical trial exclusion criteria:
Concomitant antiplatelet or anticoagulant use
Calculated creatinine clearance < 30 mL/min by Cockcroft-Gault formula
Alanine aminotransferase (ALT) or aspartate aminotransferase (AST) > 3 times upper limit of normal (ULN)
Total bilirubin > 2 x ULN
Thrombocytopenia < 50 x 10 gigalitres (Gl)
High bleeding risk or spontaneously prolonged prothrombin time or activated partial thromboplastin time > 1.5 x ULN
Body weight <50 or >120 kg
Concomitant use of CYP3A4 or p-glycoprotein inducers or inhibitors
Use of Ginkgo biloba or St. John's Wort within 14 days before first dose of study drug
Dexamethasone use within last 3 months
Women of Childbearing potential without proper contraceptive measures, pregnancy or breast feeding
Life expectancy less than 3 months
Inability to swallow or issues with malabsorption
Any other medical, social, logistical, geographical or psychological factors, which in the opinion of the investigator, would prohibit follow-up, compliance and study completion

Annotated entities:
- Drug: "antiplatelet"
- Drug: "anticoagulant"
- Temporal: "Concomitant"
- Measurement: "Calculated creatinine clearance"
- Value: "< 30 mL/min"
- Measurement: "Cockcroft-Gault formula"
- Measurement: "Alanine aminotransferase (ALT)"
- Measurement: "aspartate aminotransferase (AST)"
- Value: "> 3 times upper limit of normal (ULN)"
- Measurement: "Total bilirubin"
- Value: "> 2 x ULN"
- Measurement: "Thrombocytopenia"
- Value: "< 50 x 10 gigalitres (Gl)"
- Condition: "High bleeding risk"
- Condition: "prolonged prothrombin time"
- Qualifier: "spontaneously"
- Measurement: "activated partial thromboplastin time"
- Value: "> 1.5 x ULN"
- Condition: "Body weight"
- Value: "<50 kg"
- Value: ">120 kg"
- Drug: "CYP3A4"
- Drug: "p-glycoprotein inducers"
- Drug: "p-glycoprotein inhibitors"
- Temporal: "Concomitant"
- Drug: "Ginkgo biloba"
- Drug: "St. John's Wort"
- Temporal: "within 14 days before first dose of study drug"
- Reference_point: "first dose of study drug"
- Multiplier: "first dose"
- Drug: "study drug"
- Drug: "Dexamethasone"
- Temporal: "within last 3 months"
- Person: "Women"
- Condition: "Childbearing potential"
- Procedure: "contraceptive measures"
- Negation: "without"
- Condition: "pregnancy"
- Observation: "breast feeding"
- Observation: "Life expectancy"
- Value: "less than 3 months"
- Condition: "Inability to swallow"
- Condition: "issues with malabsorption"
- Undefined_semantics: "issues with malabsorption"
- Subjective_judgement: "Any other medical, social, logistical, geographical or psychological factors, which in the opinion of the investigator, would prohibit follow-up, compliance and study completion"
- Context_Error: "Any other medical, social, logistical, geographical or psychological factors, which in the opinion of the investigator, would prohibit follow-up, compliance and study completion"